Clinical trial inclusion criterion:
STI (rectal or vaginal gonorrhea or syphilis) diagnosis during the last 6 months.

Entity relations:
- Subsumes("STI", "rectal gonorrhea")
- OR("rectal gonorrhea", "syphilis", "vaginal gonorrhea")